Clinical trial inclusion criterion:
Male and female adolescent patients, aged 13 to 17 years, diagnosed with RLS based on the IRLSSG consensus criteria (Allen RP 2014) (Appendix 2).

Annotated entities:
- Person: "Male"
- Person: "female"
- Person: "adolescent"
- Person: "aged"
- Value: "13 to 17 years"
- Condition: "RLS"
- Measurement: "IRLSSG consensus criteria"